Clinical trial exclusion criterion:
Age less than 15 or greater than 25 and not participating in the day care center

Entity relations:
- Has_value("Age", "less than 15")
- Has_negation("participating in the day care center", "not")
- OR("less than 15", "greater than 25")